Clinical trial inclusion criterion:
4. Oral temperature > 38 C

Entity relations:
- Has_value("Oral temperature", "> 38 C")